吸菸、有高血脂、高血壓等問題者比較容易罹患冠狀動脈心臟病，但不一定都會罹患，而沒有這些因子者也有可能罹患，則這些因子是冠狀動脈心臟病的：
A. 充分致因（sufficient causes）
B. 必要致因（necessary causes）
C. 充要致因（sufficient and necessary causes）
D. 促成致因（contributing causes）

正確答案：D. 促成致因（contributing causes）